food allergy

The above is a clinical trial exclusion criterion. Annotated with entity spans:
[Condition: food allergy]